Which complex is bound by estrogen-related receptor β (Esrrb)?

Knockdown of Mp1 redirected FGF4 signaling from differentiation toward pluripotency and up-regulated the pluripotency-related genes Esrrb, Rex1, Tcl1, and Sox2. Dax1 associates with Esrrb and regulates its function in embryonic stem cells. Here, we identified an orphan nuclear receptor, Esrrb (estrogen-related receptor beta), as a Dax1-interacting protein.